Clinical trial exclusion criterion:
History of other malignancy within the last 5 years, except for appropriately treated carcinoma in situ of the cervix, non-melanoma skin carcinoma, Stage I uterine cancer, or other cancers with a similar outcome as those previously mentioned.

Entity relations:
- multi("appropriately treated", "treated")
- Has_qualifier("carcinoma in situ of the cervix", "appropriately treated")
- Has_value("Stage", "I")
- AND("uterine cancer", "Stage")
- Has_qualifier("malignancy", "other")
- Has_temporal("malignancy", "within the last 5 years")
- Has_negation("carcinoma in situ of the cervix", "except for")
- OR("carcinoma in situ of the cervix", "non-melanoma skin carcinoma", "uterine cancer")